Clinical trial exclusion criterion:
Age less than 18

Entity relations:
- Has_value("Age", "less than 18")